一位60歲女性，因屬骨質疏鬆症之高危險群，接受雙能量X光吸收儀（DEXA）骨質密度篩檢。檢查報告顯示有T值（Tscore）及Z值（Z-score），下列數值何者為骨質疏鬆症的診斷標準？
A. T值≤－1.0
B. T值≤－2.5
C. Z值≤－1.0
D. Z值≤－2.5

正確答案：B. T值≤－2.5